Clinical trial exclusion criterion:
Patients with renal disease (documented glomerular filtration rate < 60mL/min/1.73m2)

Annotated entities:
- Condition: "renal disease"
- Measurement: "glomerular filtration rate"
- Value: "< 60mL/min/1.73m2"